Clinical trial inclusion criterion:
Pregnancy or breastfeeding, or trying to conceive

Annotated entities:
- Condition: "Pregnancy"
- Observation: "breastfeeding"
- Condition: "trying to conceive"